Clinical trial exclusion criterion:
Patients who are currently receiving treatment with any medications that have the potential to prolong the QT interval or inducing Torsade de Pointes and the treatment cannot be either safely discontinued at least one week prior to nilotinib treatment or switched to a different medication prior to start of nilotinib treatment and for the duration of the study

Annotated entities:
- Procedure: "treatment"
- Temporal: "currently"
- Drug: "any medications"
- Qualifier: "have the potential to prolong the QT interval"
- Qualifier: "inducing Torsade de Pointes"
- Non-representable: "the treatment cannot be either safely discontinued at least one week prior to nilotinib treatment or switched to a different medication prior to start of nilotinib treatment and for the duration of the study"